有關冠心症心肌缺氧之敘述，下列何者錯誤？
A. 心肌缺氧（myocardial ischemia）是因為心臟氧氣的供應，不足以應付新陳代謝的需求
B. 穩定性心絞痛患者，其胸痛可能持續數小時之久
C. 不穩定心絞痛患者，其胸痛有可能是在休息狀態下發作
D. 有些患者心肌缺氧發作時，僅有下巴、脖子、肩膀或手臂不適，而無胸痛

正確答案：B. 穩定性心絞痛患者，其胸痛可能持續數小時之久